History of panic disorder, psychosis, bipolar disorder, or eating disorders

The above is a clinical trial exclusion criterion. Annotated with entity spans:
History of [Condition: panic disorder], [Condition: psychosis], [Condition: bipolar disorder], or [Condition: eating disorders]